Clinical trial inclusion criterion:
Patients without history of inner ear disease

Entity relations:
- Has_negation("inner ear disease", "without")
- Has_temporal("inner ear disease", "history")